Clinical trial inclusion criterion:
Written informed consent signed and agreed to receive periodic follow-up

Annotated entities:
- Post-eligibility: "Written informed consent signed and agreed to receive periodic follow-up"